游離的神經纖維末梢（free nerve ending）最遠終止於皮膚表皮層（epidermis）的何處？
A. 基底層（stratum basale）
B. 棘狀層（stratum spinosum）
C. 顆粒層（stratum granulosum）
D. 角質層（stratum corneum）

正確答案：C. 顆粒層（stratum granulosum）